Active hepatic disease

The above is a clinical trial exclusion criterion. Annotated with entity spans:
[Qualifier: Active] [Condition: hepatic disease]